膝關節後十字韌帶是由那條血管供給？
A. 上外膝關節動脈（Superior lateral genicular artery）
B. 上內膝關節動脈（Superior medial genicular artery）
C. 下內膝關節動脈（Inferior medial genicular artery）
D. 中膝關節動脈（Middle genicular artery）

正確答案：D. 中膝關節動脈（Middle genicular artery）